Clinical trial exclusion criterion:
evidence of severe cardiac disease.

Entity relations:
- Has_qualifier("cardiac disease", "severe")
- Has_mood("cardiac disease", "evidence of")